心臟聽診檢查時，發現在正中鎖骨線第 5 肋間處有異常雜音，下列何者最可能發生病變？
A. 二尖瓣（mitral valve）
B. 主動脈瓣（aortic valve）
C. 三尖瓣（tricuspid valve）
D. 肺動脈幹瓣（pulmonary valve）

正確答案：A. 二尖瓣（mitral valve）